Clinical trial inclusion criterion:
Cerebral palsy of any types caused by Neonatal Jaundice

Entity relations:
- AND("Cerebral palsy", "Neonatal Jaundice")